Clinical trial exclusion criterion:
Abdominal and complex cervical cerclage (e.g. bulging bag)

Annotated entities:
- Procedure: "cervical cerclage"
- Qualifier: "complex"
- Qualifier: "Abdominal"
- Qualifier: "bulging bag"